Clinical trial inclusion criterion:
Failed response to previous trial of two anti-epileptic drugs. In the case of infantile spasms this could include a trial of corticosteroids.

Annotated entities:
- Drug: "anti-epileptic drugs"
- Multiplier: "two"
- Condition: "response"
- Qualifier: "Failed"
- Drug: "corticosteroids"